Clinical trial exclusion criterion:
Inflammatory condition e.g. Connective tissue disorder, Rheumatoid arthritis

Annotated entities:
- Condition: "Inflammatory"
- Condition: "Connective tissue disorder,"
- Condition: "Rheumatoid arthritis"